Clinical trial inclusion criterion:
Patients without functional impairment of organs: liver function: total bilirubin, AST, ALT, alfa-GT and alkaline phosphatase less than 3 times the upper limit of normal laboratory renal function: serum creatinine < 2 mg/dL or clearance creatinine > 30 ml/min (except renal function attributable to LAL) cardiac function (Appendix B) normal: ventricular EF > 50%, absence of severe chronic respiratory disease. In the event that alterations are secondary to the disease is at the discretion of the investigator to determine if the patient can be included in the trial.

Entity relations:
- Has_negation("functional impairment of organs", "without")
- Has_value("total bilirubin", "less than 3 times the upper limit of normal")
- Has_value("cardiac function", "normal")
- Has_value("clearance creatinine", "> 30 ml/min")
- Has_value("serum creatinine", "< 2 mg/dL")
- Has_value("ventricular EF", "> 50%")
- Has_negation("severe chronic respiratory disease", "absence of")
- Subsumes("cardiac function", "ventricular EF")
- Subsumes("functional impairment of organs", "serum creatinine")
- Has_value("AST", "less than 3 times the upper limit of normal")
- Has_value("ALT", "less than 3 times the upper limit of normal")
- Has_value("alfa-GT", "less than 3 times the upper limit of normal")
- Has_value("alkaline phosphatase", "less than 3 times the upper limit of normal")
- OR("serum creatinine", "clearance creatinine")